有關甲狀舌管囊腫（thyroglossal duct cyst）之敘述，下列何者錯誤？
A. 為兒童最常見之先天性頸部腫塊
B. 通常發生在頸部外側
C. 通常無症狀或以反覆發炎為表現
D. 觸診時可發現囊腫隨著吞嚥動作上下移動

正確答案：B. 通常發生在頸部外側